Breast - Karnofsky score > 50;

The above is a clinical trial inclusion criterion. Annotated with entity spans:
[Measurement: Breast - Karnofsky score] [Value: > 50];